Clinical trial exclusion criteria:
Pregnant or lactating women
Women with breast implants on the same side as the lesion
Women that underwent local radiation or chemotherapy within the last 12 months
Women with history of breast cancer or breast surgery in the same quadrant
Lesions in or close to scar tissue (< 1cm)
Skin lesions or lesions that have been biopsied previously
Lesion larger than 4 cm in the longest dimension
No lesion should be included when more than 50% of the lesion is further down than 4 cm beneath the skin level.

Annotated entities:
- Condition: "Pregnant"
- Condition: "lactating"
- Person: "women"
- Person: "Women"
- Device: "breast implants"
- Qualifier: "same side as the lesion"
- Reference_point: "the lesion"
- Procedure: "local radiation"
- Procedure: "chemotherapy"
- Temporal: "within the last 12 months"
- Person: "Women"
- Person: "Women"
- Condition: "breast cancer"
- Condition: "breast surgery"
- Qualifier: "same quadrant"
- Condition: "Lesions"
- Qualifier: "in or close to scar tissue"
- Value: "< 1cm"
- Condition: "Skin lesions"
- Condition: "lesions"
- Procedure: "biopsied"
- Temporal: "previously"
- Condition: "Lesion"
- Value: "larger than 4 cm"
- Measurement: "longest dimension"
- Condition: "lesion"
- Multiplier: "more than 50% of the lesion"
- Value: "further down than 4 cm"
- Measurement: "beneath the skin level"